Use of supplements containing nitrates and supplements containing stimulants (such as ephedra) are exclusionary in the two weeks prior to initial screen (P1) visit and prohibited throughout the study. Participants who take these supplements will be asked to discontinue them for a minimum of two weeks before the Preliminary Screening Period (P1 visit)..

The above is a clinical trial exclusion criterion. Annotated with entity spans:
Use of supplements containing [Drug: nitrates] and supplements containing [Drug: stimulants] (such as [Drug: ephedra]) are exclusionary [Temporal: in the two weeks prior to initial screen (P1) visit] and prohibited throughout the study. Participants who take these supplements will be asked to discontinue them for a minimum of two weeks before the Preliminary Screening Period (P1 visit)..